Clinical trial exclusion criterion:
Current severe depression (HAM-D >24) or anxiety (HAM-A >24)

Entity relations:
- Has_value("HAM-D", ">24")
- Subsumes("severe", "HAM-D")
- Has_qualifier("depression", "severe")
- Subsumes("severe", "HAM-A")
- Has_value("HAM-A", ">24")
- Has_temporal("depression", "Current")
- Has_temporal("severe", "Current")
- OR("depression", "anxiety")